Clinical trial exclusion criterion:
Body weight less than 50 kg

Annotated entities:
- Measurement: "Body weight"
- Value: "less than 50 kg"